Clinical trial inclusion criterion:
Locally advanced disease as determined by endoscopic ultrasound (EUS) stage > primary tumor (T) 3 and/or any T, lymph nodes (N)+ disease without metastatic disease (Mx)

Entity relations:
- Has_qualifier("disease", "Locally advanced")
- Has_value("endoscopic ultrasound", "> primary tumor (T) 3 and/or any T, lymph nodes (N)+ disease without metastatic disease (Mx)")
- AND("disease", "endoscopic ultrasound")
- Subsumes("endoscopic ultrasound", "EUS")